Clinical trial exclusion criterion:
a chronic use of non-steroidal anti-inflammatory drugs, (NSAID)

Annotated entities:
- Condition: "chronic use"
- Drug: "non-steroidal anti-inflammatory drugs"
- Drug: "NSAID"